35 歲女性，G5P2A2，妊娠 35 週，急診剖腹生產發現「子宮胎盤中風」（uteroplacental apoplexy），請問最可能的診斷為：
A. 子宮破裂
B. 胎盤早期剝離
C. 前置胎盤
D. 羊水栓塞

正確答案：B. 胎盤早期剝離